對於手部燒傷的治療，下列敘述何者錯誤？
A. 傷口	早癒合，是避免攣縮最好的方式
B. 需要使用副木（splint），以維持掌指關節伸展（MP joint extension）及指間關節伸展（IP joint
C. 維持手部功能姿勢（functional position），是為了避免伸展肌腱攣縮（extensor tendon contracture）
D. 拇指應維持在外展（abduction）的位置

正確答案：B. 需要使用副木（splint），以維持掌指關節伸展（MP joint extension）及指間關節伸展（IP joint